下列有關先天性巨大結腸症（Hirschsprung disease）之敘述，何者錯誤？
A. 病灶好發於直腸乙狀結腸（rectosigmoid）處
B. 出現胎便（meconium）排出遲緩現象
C. 可能出現小腸結腸炎（enterocolitis）合併敗血症
D. 肛診可發現肛門張力（anal tone）下降

正確答案：D. 肛診可發現肛門張力（anal tone）下降